Clinical trial inclusion criteria:
premenopausal women
BRCA1 carrier

Annotated entities:
- Condition: "premenopausal"
- Person: "women"
- Condition: "BRCA1 carrier"